Clinical trial exclusion criterion:
Valvular Heart Disease including those with prosthetic valve, mitral stenosis (moderate to severe) or valve repair.

Annotated entities:
- Condition: "Valvular Heart Disease"
- Device: "prosthetic valve"
- Condition: "mitral stenosis"
- Qualifier: "moderate"
- Qualifier: "severe"
- Procedure: "valve repair"